Subjects over the age of 18 years who agree informed consent and who have at least one polyp of eligible size (6-10mm)

The above is a clinical trial inclusion criterion. Annotated with entity spans:
Subjects over the [Person: age] of [Value: 18 years] who [Non-query-able: agree informed consent] and who have [Multiplier: at least one] [Condition: polyp] of [Qualifier: eligible size] ([Value: 6-10mm])